BMI <18.5

The above is a clinical trial exclusion criterion. Annotated with entity spans:
[Measurement: BMI] [Value: <18.5]